Subject in an exclusion period from another study,

The above is a clinical trial exclusion criterion. Annotated with entity spans:
[Context_Error: Subject in an exclusion period from another study,]